Clinical trial inclusion criterion:
Amenorrhea and FSH> 30mUI/ml according to the criteria of the index subject

Entity relations:
- Has_value("FSH", "> 30mUI/ml")